What 3 disorders are commonly associated with Kaufman-McKusick syndrome?

Mekusick-Kusick syndrome is a rare autosomal recessive disorder characterized by the triad of hydrometrocolpos, postaxial polydactyly, and congenital heart disease.